懷孕婦女在懷孕期接受 primidone 等抗癲癇藥物治療，通常其新生兒會發生下列那一種凝血因子的缺乏症？
A. Vitamin K-依賴型凝血因子
B. Thrombin
C. Fibrin
D. Fibrinogen

正確答案：A. Vitamin K-依賴型凝血因子